Clinical trial inclusion criterion:
MLA(minimal luminal area)<4mm2

Annotated entities:
- Measurement: "MLA"
- Measurement: "minimal luminal area"
- Value: "<4mm2"